Clinical trial inclusion criterion:
White blood cell count, platelet, hematocrit, tuberculosis, aspartate aminotransferase (AST), alanine aminotransferase (ALT), alkaline phosphatase, creatinine, and HIV test results reviewed by transplant center

Entity relations:
- Has_qualifier("White blood cell count", "reviewed by transplant center")
- Has_qualifier("platelet", "reviewed by transplant center")
- Has_qualifier("hematocrit", "reviewed by transplant center")
- Has_qualifier("tuberculosis", "reviewed by transplant center")
- Has_qualifier("aspartate aminotransferase (AST)", "reviewed by transplant center")
- Has_qualifier("alanine aminotransferase (ALT)", "reviewed by transplant center")
- Has_qualifier("alkaline phosphatase", "reviewed by transplant center")
- Has_qualifier("creatinine", "reviewed by transplant center")
- Has_qualifier("HIV test results", "reviewed by transplant center")